Clinical trial inclusion criterion:
Healthy subjects as established by medical history and clinical examination before entering into the study. Healthy subjects with no medical conditions that, in the opinion of the investigator, prevents the subject from participating in the study.

Entity relations:
- Has_index("before entering into the study", "entering into the study")
- Has_temporal("Healthy", "before entering into the study")
- Has_temporal("Healthy", "medical history")
- AND("Healthy", "clinical examination")